Cardiovascular, kidney or hepatic diseases;

The above is a clinical trial exclusion criterion. Annotated with entity spans:
[Condition: Cardiovascular], [Condition: kidney] or [Condition: hepatic diseases];